Which class of genes are mutated in Diamond Blackfan Anemia patients?

blackfan anemia (dba) is an inherited erythroblastopenia associated with mutations in at least 8 different ribosomal protein genes. . genes encoding ribosomal proteins have been associated to dba: after rps19 , mutations in genes rps24 and rps17 were recently identified in a fraction of the patients. . 25% of patients with diamond-blackfan anaemia 19q13 gene mutation was detected , and recent findings suggest another gene located on 8p23.3-p22 chromosome. . transgenic mouse model demonstrates a dominant negative effect of a point mutation in the rps19 gene associated with diamond-blackfan anemia . also report the prevalence of rps 19 mutations in the italian dba population , as shown by an analysis of 56 patients. . in the gene encoding ribosomal protein (rp) s19 have recently been found in 25% of patients with either the dominant or the sporadic form. .